一位35歲男性卡車司機，一向身體健康，這2年來因須開長途夜車而吸食安非他命，最近兩週產生明顯之聽幻覺及被害妄想、易躁動（agitation）且易怒而打傷同事，下列何者錯誤？
A. 宜停止使用安非他命
B. 可短期使用抗精神病劑，如haloperidol
C. 若難以照顧時，可先肢體約束以降低傷人自傷風險，然須密切觀察
D. 若有憂鬱症狀，可給予情緒穩定劑，如carbamazepine

正確答案：D. 若有憂鬱症狀，可給予情緒穩定劑，如carbamazepine